Clinical trial exclusion criterion:
Has untreated active Hepatitis B

Annotated entities:
- Condition: "Hepatitis B"
- Qualifier: "untreated"
- Qualifier: "active"